Clinical trial inclusion criterion:
Women with PCOS as defined by the Rotterdam criteria.

Entity relations:
- AND("Rotterdam criteria", "PCOS")